Corresponde a una mutación por transversión el cambio:
1. T → C.
2. A → T.
3. G → A.
4. C → T.
5. A → G.

Respuesta correcta: 2. A → T.